睪丸癌的轉移，除了絨毛膜癌外，大都隨著固定的淋巴路線轉移，下列敘述何者錯誤？
A. 右側睪丸最先轉移到主動脈下腔靜脈間（interaortocaval）淋巴腺
B. 左側則是左腎門附近的主動脈旁（para-aortic）淋巴腺
C. 如腫瘤侵犯附睪、精索時，常會轉移至腹股溝淋巴腺
D. 傳統後腹腔淋巴清除手術最常見併發症是不能射精

正確答案：C. 如腫瘤侵犯附睪、精索時，常會轉移至腹股溝淋巴腺